Clinical trial inclusion criterion:
7. Informed consent obtained and signed

Annotated entities:
- Post-eligibility: "Informed consent obtained and signed"
- Non-query-able: "Informed consent obtained and signed"